Clinical trial exclusion criterion:
Persons with impaired immune responsiveness (of any cause), including diabetes mellitus and autoimmune disorders

Entity relations:
- Subsumes("impaired immune responsiveness", "diabetes mellitus")
- OR("diabetes mellitus", "autoimmune disorders")